Clinical trial exclusion criterion:
Pregnant or nursing females, or plan to become pregnant or nurse during the study period

Annotated entities:
- Condition: "Pregnant"
- Observation: "nursing"
- Person: "females"
- Mood: "plan to"
- Observation: "become pregnant"
- Observation: "nurse"
- Temporal: "during the study period"